Clinical trial exclusion criterion:
Significant preoperative pain requiring treatment with high doses of opioids (more than 6-8 Norco tablets or equivalence per day) or recent history of opioid abuse

Entity relations:
- Has_qualifier("preoperative pain", "Significant")
- Has_multiplier("opioids", "high doses")
- Has_mood("opioids", "requiring")
- AND("preoperative pain", "opioids")
- Subsumes("Norco tablets", "equivalence")
- Has_multiplier("Norco tablets", "more than 6-8 per day")
- Has_temporal("opioid abuse", "history")
- Has_temporal("opioid abuse", "recent")
- Subsumes("high doses", "Norco tablets")
- OR("preoperative pain", "opioid abuse")